Clinical trial exclusion criterion:
history of drug use or alcool abuse in the last 12 months

Entity relations:
- Has_temporal("drug use", "last 12 months")
- OR("drug use", "alcool abuse")